Clinical trial exclusion criterion:
Treatment with anticholinergic medication in the last 2 months

Annotated entities:
- Drug: "anticholinergic medication"
- Temporal: "last 2 month"